Clinical trial exclusion criterion:
1. For subjects in Cohort A: previous therapy for more than 48 hours with any parenteral antibiotic with activity against S. aureus within 72 hours of positive blood culture results.

Annotated entities:
- Observation: "Cohort A"
- Non-query-able: "Cohort A"
- Procedure: "therapy"
- Undefined_semantics: "therapy"
- Temporal: "previous"
- Temporal: "for more than 48 hours"
- Drug: "parenteral antibiotic with activity against S. aureus"
- Qualifier: "with activity against S. aureus"
- Observation: "S. aureus"
- Temporal: "within 72 hours of positive blood culture results"
- Reference_point: "positive blood culture results"
- Procedure: "blood culture"
- Value: "positive results"
- Qualifier: "parenteral"